Clinical trial exclusion criterion:
Any patient considered a vulnerable subject

Annotated entities:
- Observation: "vulnerable subject"